Clinical trial exclusion criterion:
Any disorder that may interfere with drug absorption

Entity relations:
- Has_qualifier("disorder", "may interfere with drug absorption")